Clinical trial inclusion criterion:
Age 18 to 70 years old

Annotated entities:
- Person: "Age"
- Value: "18 to 70 years old"